Clinical trial exclusion criterion:
Professional drivers, risk profession or respiratory failure (according to criteria of the clinical pathway for diagnosis and treatment of sleep-disordered breathing).

Annotated entities:
- Person: "Professional drivers"
- Person: "risk profession"
- Condition: "respiratory failure"
- Procedure: "criteria of the clinical pathway for diagnosis and treatment of sleep-disordered breathing"